ASA (american society of anesthesiologists) class 1-3

The above is a clinical trial inclusion criterion. Annotated with entity spans:
[Measurement: ASA] ([Measurement: american society of anesthesiologists]) class [Value: 1-3]